Clinical trial exclusion criterion:
presence of significant scarring in the pelvic area from previous surgery.

Annotated entities:
- Condition: "significant scarring"
- Qualifier: "pelvic area"
- Procedure: "surgery"
- Qualifier: "from previous surgery"
- Temporal: "previous"